Pregnant or breast-feeding women

The above is a clinical trial exclusion criterion. Annotated with entity spans:
[Condition: Pregnant] or [Condition: breast-feeding women]